Clinical trial inclusion criterion:
=19 years of age

Entity relations:
- Has_value("age", "=19 years")